下列何種病毒，會引起睪丸、卵巢、胰臟等腺體發炎之病症？
A. 麻疹病毒
B. 呼吸道融合病毒
C. 副流行性感冒病毒
D. 腮腺炎病毒

正確答案：D. 腮腺炎病毒